關於近端腎小管的鈉離子再吸收的敘述，下列何者錯誤？
A. 在頂膜（apical membrane）鈉離子會與葡萄糖、磷離子等被協同轉運（cotransporter）吸收
B. 基底外側膜（basolateral membrane）會利用鈉－鉀－氯協同轉運蛋白（Na-K-2Cl cotransporter）運送至組織間液
C. 經由被動轉運（passive transport），一小部分的鈉離子會經由細胞間緊密連接（tight junction）重新回到腎小管腔內
D. 過濾到腎小管的鈉離子約有60%會在近端腎小管被再吸收回體循環

正確答案：B. 基底外側膜（basolateral membrane）會利用鈉－鉀－氯協同轉運蛋白（Na-K-2Cl cotransporter）運送至組織間液